Clinical trial inclusion criterion:
Physical limitations evidenced by either:

Annotated entities:
- Parsing_Error: "Physical limitations evidenced by either:"